Clinical trial exclusion criterion:
Active alcohol or opioid substitution therapy

Annotated entities:
- Procedure: "opioid substitution therapy"
- Observation: "alcohol"